Which gene controls the consistency of cerumen (ear wax)?

A single nucleotide polymorphism (SNP) in ABCC11 affects the cerumen VOC profiles of individuals from African, Caucasian, and Asian descent